有關失智老人臨床使用鼻胃管餵食的敘述，下列何者錯誤？
A. 家屬不忍心病人挨餓或消瘦
B. 大多數失智老人仍保有飢餓感而能經口進食
C. 鼻胃管可降低吸入性肺炎的發生率
D. 失智老人至末期因噁心不能進食應視同呼吸衰竭的狀況，不使用人工餵食

正確答案：C. 鼻胃管可降低吸入性肺炎的發生率